Clinical trial inclusion criterion:
Creatinine <2.0 mg/dL, or creatinine clearance >40 mL/min (as calculated by the Cockcroft-Gault method.

Annotated entities:
- Measurement: "Creatinine"
- Value: "<2.0 mg/dL"
- Measurement: "creatinine clearance"
- Value: ">40 mL/min"
- Qualifier: "Cockcroft-Gault method"